Clinical trial exclusion criterion:
Diaphragmatic palsy

Annotated entities:
- Condition: "Diaphragmatic palsy"